Señalar en que trastorno de la personalidad se observa la ausencia de remordimientos y la incapacidad para planificar el futuro:
1. Trastorno paranoide de la personalidad.
2. Trastorno límite de la personalidad.
3. Trastorno antisocial de la personalidad.
4. Trastorno de la personalidad por evitación.

Respuesta correcta: 3. Trastorno antisocial de la personalidad.